Clinical trial inclusion criterion:
kidney transplant recipient

Annotated entities:
- Procedure: "kidney transplant"